Clinical trial exclusion criterion:
Significant pulmonary disease, (e.g., restrictive pulmonary disease, constrictive or chronic obstructive pulmonary disease) or any other disease or malfunction of the lungs or respiratory system that produces chronic symptoms.

Annotated entities:
- Condition: "pulmonary disease"
- Qualifier: "Significant"
- Condition: "restrictive pulmonary disease"
- Condition: "chronic obstructive pulmonary disease"
- Condition: "constrictive pulmonary disease"
- Qualifier: "any other"
- Condition: "disease of the lungs"
- Condition: "malfunction of the lungs"
- Condition: "disease of the respiratory system"
- Condition: "chronic symptoms"